La disposición tridimensional de una proteína se corresponde con:
1. Su estructura primaria.
2. Su estructura secundaria.
3. Su estructura terciaria.
4. Su estructura cuaternaria.
5. Con su estructura primaria, secundaria, terciaria y cuaternaria.

Respuesta correcta: 3. Su estructura terciaria.